Clinical trial exclusion criterion:
Regular smoking and other regular nicotine use.

Annotated entities:
- Observation: "smoking"
- Multiplier: "Regular"
- Drug: "nicotine"
- Multiplier: "regular"